2. Clinical diagnosis of type 1 diabetes for at least one year.

The above is a clinical trial inclusion criterion. Annotated with entity spans:
[Parsing_Error: 2.] Clinical diagnosis of [Condition: type 1 diabetes] [Temporal: for at least one year].